Clinical trial inclusion criterion:
Aged 18 or over (up to the age of 35 which is the limit for the early intervention service)

Annotated entities:
- Value: "18 or over"
- Person: "Aged"
- Value: "up to the age of 35"